Clinical trial inclusion criterion:
moderate or severe hepatic dysfunction (Child Pugh B or C)

Entity relations:
- Has_qualifier("hepatic dysfunction", "moderate")
- Has_value("Child Pugh", "B or C")
- Subsumes("moderate", "Child Pugh")
- OR("moderate", "severe")